Clinical trial inclusion criterion:
No significant comorbidities**

Annotated entities:
- Condition: "comorbidities"
- Negation: "No"
- Qualifier: "significant"